To the ligand of which receptors does Denosumab (Prolia) bind?

Denosumab is a monoclonal antibody against the RANKL